Clinical trial inclusion criteria:
Age equal or superior to 18 years;
Both genders;
Lucid and without diagnosis of any psychiatric disorder;
Diagnosed with head and neck cancer and treated for a period of up to 5 years with radiotherapy where the major salivary glands (parotid, submandibular and sublingual) were included in the radiation field;
Primary Sjögren's syndrome with the diagnosis made by the American-European criteria.

Annotated entities:
- Person: "Age"
- Value: "equal or superior to 18 years"
- Person: "genders"
- Condition: "psychiatric disorder"
- Negation: "without"
- Condition: "Lucid"
- Condition: "head and neck cancer"
- Temporal: "5 years"
- Procedure: "radiotherapy"
- Qualifier: "major salivary glands"
- Qualifier: "parotid"
- Qualifier: "submandibular"
- Qualifier: "sublingual"
- Condition: "Primary Sjögren's syndrome"
- Qualifier: "American-European criteria"